Women subjected to ICSI through controlled ovarian hyperstimulation (COH) with pituitary downregulation by GnRHa.

The above is a clinical trial inclusion criterion. Annotated with entity spans:
[Person: Women] subjected to [Procedure: ICSI] through [Procedure: controlled ovarian hyperstimulation (COH)] with [Procedure: pituitary downregulation by GnRHa].